El incremento de energía libre estándar de la hidrólisis de ATP depende, entre otros, de la siguiente característica estructural:
1. Su carácter polar.
2. Su naturaleza anfipática.
3. Su estabilización por resonancia.
4. Del número de grupo fosforilo que contiene.
5. Del catión con el que forma la sal soluble.

Respuesta correcta: 3. Su estabilización por resonancia.